Genetic malignant hyperthermia

The above is a clinical trial exclusion criterion. Annotated with entity spans:
[Qualifier: Genetic] [Condition: malignant hyperthermia]